Clinical trial exclusion criterion:
Body mass index greater than 40 kg / m2

Annotated entities:
- Measurement: "Body mass index"
- Value: "greater than 40 kg / m2"